Clinical trial exclusion criterion:
Nephrotic range proteinuria (urinary protein > 3.5 gm/day)

Entity relations:
- Has_value("urinary protein", "> 3.5 gm/day")
- Has_qualifier("proteinuria", "Nephrotic range")
- AND("proteinuria", "urinary protein")